Clinical trial exclusion criterion:
diabetes type 1 with complications

Annotated entities:
- Condition: "diabetes type 1"
- Condition: "complications"